Any condition that in the opinion of the investigator or the Novartis medical monitor would jeopardize the evaluation of efficacy or safety

The above is a clinical trial exclusion criterion. Annotated with entity spans:
Any [Condition: condition] [Qualifier: that] [Non-representable: in the opinion of the investigator] or the Novartis medical monitor would jeopardize the evaluation of efficacy or safety